(1) Menopause (non-therapy-induced amenorrhea of more than 12 months) Female

The above is a clinical trial exclusion criterion. Annotated with entity spans:
(1) [Condition: Menopause] ([Qualifier: non-therapy-induced] [Condition: amenorrhea] of [Multiplier: more than 12 months]) [Person: Female]